下列關於導管相關尿路感染（catheter-associated urinary tract infection）的敘述，何者正確？
A. 常規使用抗生素塗抹於尿道口是預防導管相關尿路感染最有效的措施
B. 常規使用口服抗生素預防導管相關尿路感染是實證依據強烈建議的措施
C. 導管相關尿路感染的發生與尿路導管材質的品質關係最大
D. 經尿管輸液沖洗膀胱，即使在輸液內加入抗生素，仍可能增加導管相關尿路感染的機會

正確答案：D. 經尿管輸液沖洗膀胱，即使在輸液內加入抗生素，仍可能增加導管相關尿路感染的機會